Clinical trial inclusion criterion:
Disease limited to the liver Unresectable disease by surgery or other local therapies

Entity relations:
- Has_qualifier("local therapies", "other")
- AND("Unresectable disease", "surgery")
- OR("surgery", "local therapies")
- OR("Disease limited to the liver", "Unresectable disease")